一位40歲男性病患，到急診室求診主訴為吐鮮血（hematemesis），他過去很健康無消化性潰瘍及慢性肝病病史，最近亦無服用任何藥物，也無體重減輕現象，吐血前曾和朋友應酬聚餐及喝酒，並有劇烈嘔吐現象，您面對此病人首先要做的事是：
A. 插鼻胃管看有無胃出血
B. 量vital signs，打上點滴輸液
C. 趕快安排抽血檢	血色素看有無貧血
D. 趕快打電話會診胃腸科醫師

正確答案：B. 量vital signs，打上點滴輸液